Clinical trial inclusion criterion:
Measurable or non-measurable disease per RECIST Version 1.1.

Entity relations:
- AND("Measurable disease", "RECIST Version 1.1")
- OR("Measurable disease", "non-measurable disease")